Clinical trial exclusion criterion:
2. Past or current history of neoplasm other than the entry diagnosis, with the exception of treated non-melanoma skin cancer or carcinoma in-situ of any primary site, or invasive cancers treated definitively, with treatment ending >5 years previously and no evidence of recurrences.

Entity relations:
- multi("treated", "treated")
- Has_qualifier("non-melanoma skin cancer", "treated")
- Has_qualifier("cancers", "invasive")
- multi("treated definitively", "treated")
- Has_qualifier("cancers", "treated definitively")
- Has_negation("evidence of recurrences", "no")
- Has_temporal("neoplasm", "history")
- multi("other than the entry diagnosis", "entry diagnosis")
- Has_qualifier("neoplasm", "other than the entry diagnosis")
- Has_temporal("treated", ">5 years previously")
- Has_negation("non-melanoma skin cancer", "with the exception of")
- Has_negation("evidence of recurrences", "with the exception of")
- OR("non-melanoma skin cancer", "carcinoma in-situ", "cancers")
- OR("Past", "current")